妊娠滋養細胞疾病（gestational trophoblastic disease）轉移到腦的治療，在沒有出血及壓迫性症狀的狀況下，下列何者是NETDC （New England Trophoblastic Disease Center [Dana-Farber Cancer Institute]）所建議的優先治療方法？
A. 全腦放射線治療（whole-brain radiation）
B. 立體定位放射線手術治療（stereotactic radiosurgery）
C. 開顱手術（craniotomy）
D. 結合化療及放射線治療（combination of chemotherapy and brain irradiation）

正確答案：D. 結合化療及放射線治療（combination of chemotherapy and brain irradiation）